目前對確定診斷具存活力，但生活品質及預後很不好之先天異常的新生嬰兒，醫界大多共識同意可以不給予急救措施，下列何者未被包含在內？
A. Trisomy 13
B. Trisomy 18
C. Trisomy 21
D. Anencephaly

正確答案：C. Trisomy 21